Clinical trial exclusion criterion:
7. history of psychosis or other Axis I disorder that is primary;

Annotated entities:
- Parsing_Error: "7."
- Condition: "psychosis"
- Condition: "Axis I disorder"
- Qualifier: "primary"
- Temporal: "history"